Clinical trial exclusion criteria:
Patients in whom the preferred treatment is CABG(Coronary artery bypass grafting)
Stented lesion
Bypass graft lesion
The patients who have more than or equal to 3 target lesions
2 target lesions in the same coronary territory
Heavily calcified or angulated lesion
Bifurcation lesion requiring 2 stenting technique
Contraindication to or planned discontinuation of dual antiplatelet therapy within 1 year
Life expectancy less than 2 years
Planned cardiac surgery or planned major non cardiac surgery
Woman who are breastfeeding, pregnant or planning to become pregnant during the course of the study

Annotated entities:
- Procedure: "CABG"
- Procedure: "Coronary artery bypass grafting"
- Device: "Stented"
- Condition: "lesion"
- Device: "Bypass graft"
- Condition: "lesion"
- Multiplier: "more than or equal to 3"
- Condition: "target lesions"
- Multiplier: "2"
- Condition: "target lesions"
- Qualifier: "in the same coronary territory"
- Qualifier: "Heavily calcified"
- Qualifier: "angulated"
- Condition: "lesion"
- Condition: "Bifurcation lesion"
- Multiplier: "2"
- Procedure: "stenting technique"
- Condition: "Contraindication"
- Mood: "planned discontinuation"
- Procedure: "dual antiplatelet therapy"
- Temporal: "within 1 year"
- Observation: "Life expectancy"
- Value: "less than 2 years"
- Procedure: "cardiac surgery"
- Mood: "planned"
- Mood: "Planned"
- Qualifier: "major"
- Procedure: "non cardiac surgery"
- Person: "Woman"
- Observation: "breastfeeding"
- Condition: "pregnant"
- Mood: "planning to become"
- Condition: "pregnant"
- Temporal: "during the course of the study"